Clinical trial exclusion criterion:
History of prior treatment with disulfiram

Entity relations:
- Has_temporal("disulfiram", "History of prior treatment")